Clinical trial exclusion criterion:
Evidence of severe symptomatic heart failure (NYHA Class III or IV)

Entity relations:
- Has_qualifier("heart failure", "symptomatic")
- Has_qualifier("heart failure", "severe")
- Has_value("NYHA", "Class III or IV")